Clinical trial inclusion criterion:
Patient's willingness to participate in the study

Annotated entities:
- Informed_consent: "Patient's willingness to participate in the study"